Clinical trial exclusion criterion:
Kidney or liver disease or advanced-stage cardiopulmonary

Annotated entities:
- Condition: "liver disease"
- Condition: "Kidney disease"
- Condition: "advanced-stage cardiopulmonary"